關於高期別之非精細胞胚胎細胞癌（nonseminoma germ cell carcinoma），下列何者不是預測其化學治療之反應指標？
A. 血清LDH
B. 血清β-hCG
C. 血清CEA
D. 轉移部位總數

正確答案：C. 血清CEA